50歲的男性，有肝癌病史。約在兩天前，突然發生嚴重的背痛且無法行走，磁振造影（MRI）檢查顯示在第十二胸椎出現腫瘤轉移，且有嚴重神經壓迫情形。病患亦被醫師告知有馬尾症候群（cauda equina syndrome）。下列何者不是馬尾症候群的典型症狀？
A. 大小便失禁或滯留
B. 下肢深層肌腱反射（deep tendon reflex）增強
C. 肛門周圍麻木
D. 下肢無力

正確答案：B. 下肢深層肌腱反射（deep tendon reflex）增強